下列那種膽汁成分之相對比例，最易導致膽結石的產生？
A. 膽鹽30%、卵磷脂60%、膽固醇10%
B. 膽鹽40%、卵磷脂55%、膽固醇5%
C. 膽鹽80%、卵磷脂10%、膽固醇10%
D. 膽鹽60%、卵磷脂25%、膽固醇15%

正確答案：D. 膽鹽60%、卵磷脂25%、膽固醇15%